Clinical trial exclusion criterion:
Radiofrequency treatment history,

Entity relations:
- Has_temporal("Radiofrequency treatment", "history")